Subject must have a diagnosis of COPD based on the American Thoracic Society (ATS)/ European Respiratory Society (ERS) criteria.

The above is a clinical trial inclusion criterion. Annotated with entity spans:
Subject must have a diagnosis of [Condition: COPD] based on the [Measurement: American Thoracic Society (ATS)/ European Respiratory Society (ERS) criteria].